Have participated in any other studies involving investigational products within 30 days prior to entry into this study.

The above is a clinical trial exclusion criterion. Annotated with entity spans:
[Observation: Have participated in any other studies involving investigational products] [Temporal: within 30 days prior to entry into this study].